植物荷爾蒙 Indole-3-acetic acid 是由下列何種胺基酸代謝而來？
A. Arginine
B. Histidine
C. Tryptophan
D. Phenylalanine

正確答案：C. Tryptophan